Clinical trial exclusion criterion:
chronic lower urinary tract infections (but not simple asymptomatic bacteriuria)

Entity relations:
- Has_qualifier("lower urinary tract infections", "chronic")
- Has_negation("asymptomatic bacteriuria", "not")